uncontrolled asthma, or

The above is a clinical trial exclusion criterion. Annotated with entity spans:
[Qualifier: uncontrolled] [Condition: asthma], or